Clinical trial inclusion criterion:
Breech presentation

Annotated entities:
- Observation: "Breech presentation"